Which biomarkers are currently used for Duchenne Muscular Dystrophy?

malate dehydrogenase 2 as candidate prognostic biomarker for Duchenne muscular dystrophyMRI measurements can be used as biomarkers of disease severity in ambulant patients with DMD.